Clinical trial inclusion criterion:
The participant has received a levodopa combination drug for >= 1 month and has either of the following.

Entity relations:
- Has_temporal("levodopa combination", ">= 1 month")